Clinical trial inclusion criterion:
Estimated weight loss less than or equal to 10% in the 3 months before study randomization

Entity relations:
- Has_index("3 months before study randomization", "study randomization")
- Has_value("Estimated weight loss", "less than 10%")
- Has_temporal("Estimated weight loss", "3 months before study randomization")
- OR("less than 10%", "equal to 10%")